¿En cual de los siguientes contextos clínicos NO está recomendado el uso de gammaglobulinas intravenosas?
1. Tratamiento sustitutivo en inmunodeficiencias humorales (defecto en la formación de anticuerpos).
2. Prevención de la gammapatía monoclonal de significado incierto (MGUS).
3. Tratamiento del síndrome de Kawasaki.
4. Manejo de patologías neurológicas inflamatoria/autoinmune (Sd. Guillain-Barré, esclerosis múltiple).
5. Manejo terapéutico de la púrpura trombopénica inmune (PTI).

Respuesta correcta: 2. Prevención de la gammapatía monoclonal de significado incierto (MGUS).